Clinical trial exclusion criterion:
Active or past psychotic disorder, including a history of psychotic affective state

Entity relations:
- Has_temporal("psychotic disorder", "Active")
- Subsumes("psychotic disorder", "psychotic affective state")
- OR("Active", "past")